Clinical trial inclusion criteria:
Subjects over the age of 18 years who agree informed consent and who have at least one polyp of eligible size (6-10mm)

Annotated entities:
- Person: "age"
- Value: "18 years over"
- Non-query-able: "agree informed consent"
- Post-eligibility: "agree informed consent"
- Multiplier: "at least one"
- Condition: "polyp"
- Qualifier: "eligible size"
- Context_Error: "eligible size"
- Value: "6-10mm"